Known allergy/ hypersensitivity reaction to Brimonidine

The above is a clinical trial exclusion criterion. Annotated with entity spans:
Known [Condition: allergy]/ [Condition: hypersensitivity] reaction to [Drug: Brimonidine]